一個四歲的痙攣型腦性麻痺患者至門診檢查發現有嚴重的右側髖關節脫臼，下列敘述何者錯誤？
A. 若置之不理，慢慢會導致脊柱側彎
B. 會導致兩腳不等長
C. 對步態會有影響
D. 青春期再開刀比較安全

正確答案：D. 青春期再開刀比較安全